Clinical trial exclusion criterion:
History of diarrhoea in 7 days prior to first dose of vaccine (defined as =3 unformed loose stools in 24 hours).

Annotated entities:
- Condition: "diarrhoea"
- Temporal: "in 7 days prior to first dose of vaccine"
- Reference_point: "first dose of vaccine"
- Value: "=3"
- Measurement: "unformed loose stools in 24 hours"
- Temporal: "History"